Se puede activar el circuito del refuerzo mediante la estimulación eléctrica del sistema mesolímbico, originando en el área tegmental ventral y que proyecta:
1. Al hipocampo, inhibiendo la liberación de dopamina.
2. Al núcleo accumbens, provocando liberación de dopamina.
3. A la corteza prefrontal, estimulando la liberación de glutamato.
4. A la formación reticular mesencefálica, provocando liberación de glutamato.
5. A la hipófisis, inhibiendo la liberación de dopamina.

Respuesta correcta: 2. Al núcleo accumbens, provocando liberación de dopamina.